一位出生體重 4600 公克的嬰兒，出生後右上肢癱軟無力，深部肌腱反射（deep tendon reflex）消失，右側沒有摩洛氏反射（Moro reflex）及掌握反射（Palmar grasp reflex），但其他肢體活動正常，X 光顯示有右側鎖骨（clavicle）骨折，最有可能的診斷為何？
A. 右側臂神經叢傷害（brachial plexus injury）
B. 右側偏癱型腦性麻痺（cerebral palsy）
C. 脊髓肌肉萎縮症（spinal muscular atrophy）
D. 重症肌無力（myasthenia gravis）

正確答案：A. 右側臂神經叢傷害（brachial plexus injury）